Clinical trial exclusion criterion:
History of psychiatric disorders other than unipolar major depression or generalized anxiety disorder (bipolar disorder, hypomania, and dysthymia are exclusion criteria);

Entity relations:
- Has_negation("unipolar major depression", "other than")
- Subsumes("psychiatric disorders", "bipolar disorder")
- OR("unipolar major depression", "generalized anxiety disorder")
- OR("bipolar disorder", "hypomania", "dysthymia")